Provided informed consent.

The above is a clinical trial inclusion criterion. Annotated with entity spans:
[Non-query-able: Provided informed consent.]